Heart rate >110 beats/min

The above is a clinical trial inclusion criterion. Annotated with entity spans:
[Measurement: Heart rate] [Value: >110 beats/min]